Clinical trial exclusion criterion:
Subjects with cognitive, psychiatric, or other problems that preclude informed consent.

Annotated entities:
- Condition: "cognitive problems"
- Condition: "psychiatric problems"
- Condition: "other problems that preclude informed consent"
- Undefined_semantics: "Subjects with cognitive, psychiatric, or other problems that preclude informed consent"
- Subjective_judgement: "other problems that preclude informed consent"